關於代謝症候群（metabolic syndrome）之敘述，下列何者錯誤？
A. 與胰島素作用的阻抗（insulin resistance）有關
B. 血中小而緻密的低密度脂蛋白（small, dense LDL）濃度會減少
C. 會增加心血管疾病的風險
D. 血中極低密度脂蛋白（VLDL） 的濃度會增加

正確答案：B. 血中小而緻密的低密度脂蛋白（small, dense LDL）濃度會減少